Clinical trial exclusion criterion:
Has or is suspected of having a family or personal history of malignant hyperthermia.

Annotated entities:
- Temporal: "personal history"
- Observation: "family"
- Condition: "malignant hyperthermia"